El mecanismo de acción de la toxina botulínica consiste en:
1. Bloquear los receptores muscarínicos de acetilcolina.
2. Bloquear los receptores nicotínicos de acetilcolina.
3. Bloquear la liberación de acetilcolina.
4. Inhibir el metabolismo de actilcolina.

Respuesta correcta: 3. Bloquear la liberación de acetilcolina.